Clinical trial exclusion criterion:
Guillain-Barré syndrome within eight weeks of a previous influenza vaccine

Entity relations:
- Has_temporal("influenza vaccine", "previous")
- AND("a previous influenza vaccine", "influenza vaccine")
- Has_index("within eight weeks of a previous influenza vaccine", "a previous influenza vaccine")
- Has_temporal("Guillain-Barré syndrome", "within eight weeks of a previous influenza vaccine")